How are nucleosome posisitions correlated with sites of 5'-methyl-cytosine (5mC) or 5-hydroxy-methyl-cytosine (5hmC)?

Using this global approach, we observe the dependency of nucleosome positioning upon the 5'-methyl-cytosine (5mC) methylation seems to function together with exonic nucleosomes and H3K36me3 for the proper splicing of transcripts with different expression levels. Using a novel bioinformatics pipeline, we show a striking anti-correlation between nucleosomic positioning and 5-hydroxymethylation at CTCF regions that is not present at promoters. Transcription, histone modifications, and DNA methylation alter this "ground state"